Clinical trial exclusion criterion:
Participation in other interventional clinical trials, including those with other investigational agents not included in this trial, within 30 days of the start of this trial and throughout the duration of this trial. Non-interventional trials (that is, observational trials) are permitted at any time point.

Entity relations:
- Has_index("within 30 days of the start of this trial", "the start of this trial")
- Has_index("throughout the duration of this trial", "the duration of this trial")
- Has_temporal("Participation in other interventional clinical trials", "within 30 days of the start of this trial")
- OR("within 30 days of the start of this trial", "throughout the duration of this trial")